WBC < 3.5/ml

The above is a clinical trial exclusion criterion. Annotated with entity spans:
[Measurement: WBC] [Value: < 3.5/ml]